Clinical trial exclusion criterion:
Unable to use the ELLIPTA inhaler and peak flow meter correctly.

Annotated entities:
- Drug: "ELLIPTA inhaler"
- Device: "peak flow meter"
- Condition: "Unable to use the ELLIPTA inhaler and peak flow meter correctly."
- Non-query-able: "Unable to use the ELLIPTA inhaler and peak flow meter correctly."
- Subjective_judgement: "Unable to use the ELLIPTA inhaler and peak flow meter correctly."